Clinical trial exclusion criterion:
Target lesion located in the left main stem

Annotated entities:
- Condition: "Target lesion"
- Qualifier: "left main stem"